Clinical trial exclusion criterion:
Poorly controlled hypertension (>170/>110)

Entity relations:
- Has_qualifier("hypertension", "Poorly controlled")